下列何者附	於尺骨的鷹嘴突（olecranon）？
A. 橈側伸腕長肌（extensor carpi radialis longus）
B. 尺側伸腕肌（extensor carpi ulnaris）
C. 伸指肌（extensor digitorum）
D. 肘肌（anconeus）

正確答案：D. 肘肌（anconeus）